Fasting glucose = 126 mg/dL on 2 occasions during screening indicating need for prompt treatment;

The above is a clinical trial exclusion criterion. Annotated with entity spans:
[Measurement: Fasting glucose] [Value: = 126 mg/dL] on [Multiplier: 2 o]ccasions during screening indicating need for prompt treatment;